Clinical trial inclusion criterion:
The patient must have severe, symptomatic (ACC/AHA Stage D symptoms) tricuspid regurgitation (TR) as assessed by 2D echocardiogram with evidence of peripheral and central venous congestion (specifically lower extremity edema and abdominal ascites requiring diuretics.)

Entity relations:
- Has_value("ACC/AHA", "Stage D")
- Subsumes("symptomatic", "ACC/AHA")
- Has_qualifier("tricuspid regurgitation", "symptomatic")
- Has_qualifier("tricuspid regurgitation", "severe")
- Subsumes("tricuspid regurgitation", "TR")
- AND("tricuspid regurgitation", "2D echocardiogram")
- AND("abdominal ascites", "diuretics")
- AND("2D echocardiogram", "peripheral venous congestion")
- Subsumes("peripheral venous congestion", "lower extremity edema")
- AND("2D echocardiogram", "central venous congestion")
- AND("peripheral venous congestion", "central venous congestion")